Clinical trial exclusion criterion:
Current treatment with prednisone/prednisolone and/or immunosuppressive medication for an indication other than autoimmune hepatitis

Entity relations:
- Has_negation("autoimmune hepatitis", "other")
- AND("prednisone", "indication")
- OR("prednisone", "prednisolone", "immunosuppressive medication")